left-handed;

The above is a clinical trial exclusion criterion. Annotated with entity spans:
[Condition: left-handed];